Clinical trial exclusion criterion:
Uncontrolled HCC, malignancy or decompensated liver cirrhosis (CTP score = 7).

Annotated entities:
- Condition: "HCC"
- Condition: "malignancy"
- Condition: "liver cirrhosis"
- Qualifier: "decompensated"
- Qualifier: "Uncontrolled"
- Measurement: "CTP score"
- Value: "= 7"